History of blood clotting or bleeding abnormalities

The above is a clinical trial exclusion criterion. Annotated with entity spans:
[Temporal: History] of [Condition: blood clotting] or [Condition: bleeding abnormalities]